Clinical trial exclusion criterion:
12. Chronic heart failure complicated with acute hemodynamic disturbance or acute decompensation within last 1 month;

Annotated entities:
- Condition: "Chronic heart failure"
- Condition: "acute hemodynamic disturbance"
- Condition: "acute decompensation"
- Temporal: "within last 1 month"